Evidence of alcohol abuse or history of alcohol abuse or illegal and/or legally prescribed drugs.

The above is a clinical trial exclusion criterion. Annotated with entity spans:
Evidence of [Condition: alcohol abuse] or [Temporal: history] of [Condition: alcohol abuse] or illegal and/or legally prescribed drugs.